Clinical trial inclusion criterion:
Subjects were to have a negative urine screen for alcohol, drugs of abuse (screening only), and cotinine.

Entity relations:
- Has_value("urine screen for cotinine", "negative")
- Has_value("urine screen for drugs of abuse", "negative")
- Has_value("urine screen for alcohol", "negative")